Requirement for renal support (either continuous or discontinuous techniques, including intermittent haemodialysis, haemofiltration and haemodiafiltration)

The above is a clinical trial exclusion criterion. Annotated with entity spans:
[Mood: Requirement for] [Condition: renal support] (either continuous or discontinuous techniques, including intermittent haemodialysis, haemofiltration and haemodiafiltration)